Which are the cardiac effects of thyronamines?

In the heart, thyronamines cause negative chronotropy, negative inotropy,reduced cardiac output and resistance to ischemic injury.